List metalloenzyme inhibitors.

Foscarnet
VT-1129
VT-1161 
BB-3497
hydroxamate molecules
siderophores